扳機指（trigger finger）為一種stenosing tenosynovitis ，發生在下列那一個pulley的位置？
A. A1
B. A2
C. A3
D. A4

正確答案：A. A1